38歲女性因尿毒症接受透析治療已有8年，於一年多前接受腎移植手術後情況良好，在例行檢查時發現血中intact parathyroid hormone（iPTH）濃度為205 pg/mL，血鈣為12 mg/dL，此時可診斷為：
A. 原發性副甲狀腺機能亢進（primary hyperparathyroidism）
B. 繼發性副甲狀腺機能亢進（secondary hyperparathyroidism）
C. 三發性副甲狀腺機能亢進（tertiary hyperparathyroidism）
D. 復發性副甲狀腺機能亢進（recurrent hyperparathyroidism）

正確答案：C. 三發性副甲狀腺機能亢進（tertiary hyperparathyroidism）